Clinical trial exclusion criterion:
Inborn errors of amino acid metabolism

Annotated entities:
- Condition: "Inborn errors of amino acid metabolism"